Clinical trial exclusion criterion:
coagulopathy

Annotated entities:
- Condition: "coagulopathy"